Patients having physical and mental ability to participate in the study

The above is a clinical trial inclusion criterion. Annotated with entity spans:
[Post-eligibility: Patients having physical and mental ability to participate in the study]